Clinical trial inclusion criteria:
All patients will be undergoing a primary unilateral total knee arthroplasty for a diagnosis of osteoarthritis

Annotated entities:
- Condition: "osteoarthritis"
- Procedure: "unilateral total knee arthroplasty"
- Qualifier: "primary"